Para calcular el coeficiente de validez, la correlación más adecuada cuando las puntuaciones del test son una variable continua y el criterio es una variable dicotómica es:
1. La correlación tetracórica.
2. El coeficiente phi.
3. La correlación de Spearman.
4. La correlación biserial puntual.

Respuesta correcta: 4. La correlación biserial puntual.